Clinical trial exclusion criterion:
End stage renal disease (CrCl < 15 ml/min)

Entity relations:
- Has_value("CrCl", "< 15 ml/min")
- Subsumes("End stage renal disease", "CrCl")